Clinical trial inclusion criterion:
Patients undergoing planned trans-femoral TAVI.

Entity relations:
- Has_qualifier("trans-femoral TAVI", "planned")
- Has_temporal("trans-femoral TAVI", "undergoing")